一位 40 歲心肌病變（cardiomyopathy）病人，有關運動測試對其預後判斷的敘述，下列何者最為正確？
A. 運動測試時，若無法達到 85%的年齡預期最大心跳率（age-predicted maximal heart rate），其預後不佳
B. 其最大心跳率與收縮壓之乘積愈高者，代表其運動耐受度（exercise capacity）愈差
C. 運動後，心跳速率快速回復至休息時的心跳速率，表示病人體適能差
D. 運動測試一開始即出現 1 mm ST segment 下降，其預後較佳

正確答案：A. 運動測試時，若無法達到 85%的年齡預期最大心跳率（age-predicted maximal heart rate），其預後不佳